Aspartate transaminase (AST) (SGOT) ≤ 2.5 X institutional ULN

The above is a clinical trial inclusion criterion. Annotated with entity spans:
[Measurement: Aspartate transaminase (AST) (SGOT)] [Value: ≤ 2.5 X institutional ULN]